Evidence of systemic disease or neoplasia expected to compromise survival during 5-yr period

The above is a clinical trial exclusion criterion. Annotated with entity spans:
Evidence of [Condition: systemic disease] or [Condition: neoplasia] [Qualifier: expected to compromise survival] [Temporal: during 5-yr period]